contra-indication to the use of rocuronium

The above is a clinical trial exclusion criterion. Annotated with entity spans:
[Condition: contra-indication] to the use of [Drug: rocuronium]